Elevated ALT or serum creatinine on screening or any clinically significant abnormalities on screening laboratory tests as determined by the Investigator.

The above is a clinical trial exclusion criterion. Annotated with entity spans:
[Value: Elevated] [Measurement: ALT] or [Measurement: serum creatinine] [Temporal: on screening] or [Non-query-able: any clinically significant abnormalities on screening laboratory tests as determined by the Investigator].